ILD criteria: diagnosis of interstitial lung disease with chronic supplemental oxygen requirement at rest and/or with exertion.

The above is a clinical trial inclusion criterion. Annotated with entity spans:
[Measurement: ILD criteria]: diagnosis of [Condition: interstitial lung disease] with [Observation: chronic supplemental oxygen requirement] [Qualifier: at rest] [Parsing_Error: and/or] [Qualifier: with exertion].